What is the average diameter of intermediate filaments?

Intermediate filaments have an average diameter of 10 nanometers (nm).